對於右肺下葉積痰的病人，使用姿勢引流的正確姿勢應為：
A. 平躺
B. 側躺，右側在上方，雙腳位置與頭部一樣高度
C. 側躺，右側在上方，雙腳位置比頭部高
D. 側躺，右側在下方，雙腳位置比頭部高

正確答案：C. 側躺，右側在上方，雙腳位置比頭部高